病人能看清楚遠方物體，卻無法從鏡子中看清自己的臉，下列何者最可能出問題？
A. 瞼板肌（tarsal muscle）
B. 睫狀肌（ciliary muscle）
C. 瞳孔擴張肌（dilator pupillae muscle）
D. 提上眼瞼肌（levator palpebrae superioris muscle）

正確答案：B. 睫狀肌（ciliary muscle）